Clinical trial inclusion criterion:
Other protocol defined inclusion criteria could apply

Annotated entities:
- Non-representable: "Other protocol defined inclusion criteria could apply"